¿En qué trastorno hay una preocupación excesiva por alguna anomalía física leve o inexistente?:
1. El trastorno de somatización.
2. La anorexia nerviosa.
3. El trastorno de ansiedad.
4. El trastorno de conversión.
5. El trastorno dismórfico corporal.

Respuesta correcta: 5. El trastorno dismórfico corporal.